Clinical trial exclusion criterion:
Iodinated contrast allergy that, in the opinion of the Investigator, cannot be adequately premedicated

Annotated entities:
- Condition: "allergy"
- Drug: "Iodinated contrast"
- Non-query-able: "Iodinated contrast allergy that, in the opinion of the Investigator, cannot be adequately premedicated"